Clinical trial exclusion criterion:
Intolerance/allergy to local anesthetics

Entity relations:
- AND("Intolerance", "local anesthetics")
- OR("Intolerance", "allergy")